Clinical trial exclusion criterion:
Dexamethasone use within last 3 months

Entity relations:
- Has_temporal("Dexamethasone", "within last 3 months")